Clinical trial exclusion criterion:
History of hepatic encephalopathy or variceal hemorrhage

Entity relations:
- OR("hepatic encephalopathy", "variceal hemorrhage")